¿Cuál de estos alimentos debe reducir de su dieta un paciente con el colesterol elevado?
1. Cereales.
2. Verduras.
3. Leche entera.
4. Aceite de oliva.
5. Pescado.

Respuesta correcta: 3. Leche entera.